遺傳密碼子（genetic codon）的 degeneracy 是指：
A. 遺傳密碼子是由二個核酸（nucleotides）所構成
B. 遺傳密碼子是由核酸重複使用所構成
C. 多個遺傳密碼子可代表同一種胺基酸（amino acid）
D. 同一遺傳密碼子在不同的生物體中代表不同種的胺基酸

正確答案：C. 多個遺傳密碼子可代表同一種胺基酸（amino acid）